下列何者不是黑質網狀部（pars reticulata of the substantia nigra）GABAergic 神經元之直接投射區域？
A. 蒼白核（globus pallidus）
B. 上丘（superior colliculus）
C. 橋腦大腦腳核（pedunculopontine nucleus）
D. 丘腦（thalamus）

正確答案：A. 蒼白核（globus pallidus）